Long life major depression. Baseline scores =16 on the 17-item Hamilton Depression Scale at baseline.

The above is a clinical trial exclusion criterion. Annotated with entity spans:
[Condition: Long life major depression]. [Measurement: Baseline scores] [Value: =16] on the [Measurement: 17-item Hamilton Depression Scale] [Temporal: at baseline].